Clinical trial inclusion criterion:
Aged 1 to < 6 years

Annotated entities:
- Line: "Aged 1 to < 6 years"
- Person: "Aged"
- Value: "1 to < 6 years"